Clinical trial exclusion criterion:
Women of child-bearing potential, defined as all women physiologically capable of becoming pregnant, unless they are using highly effective methods of contraception during the study and for 30 days after the final dose of nilotinib.

Entity relations:
- Has_index("for 30 days after the final dose of nilotinib", "the final dose of nilotinib")
- Has_temporal("contraception", "during the study")
- Has_qualifier("contraception", "highly effective methods")
- Has_negation("contraception", "unless")
- Subsumes("Women", "physiologically capable of becoming pregnant")
- Has_temporal("contraception", "for 30 days after the final dose of nilotinib")
- AND("Women", "child-bearing potential")